eGFR>60 ml/min healthy volunteers type 2 diabetes patients who otherwise healthy

The above is a clinical trial inclusion criterion. Annotated with entity spans:
[Line: eGFR>60 ml/min] [Line: healthy volunteers] [Line: type 2 diabetes patients who otherwise healthy]